What class of drugs is commonly associated with Drug-induced interstitial lung disease (DIILD)?

Numerous agents including cytotoxic and noncytotoxic drugs have the potential to cause pulmonary toxicity